What is the trade name of sildenafil?

The trade name of sildenafil is Viagra.